有關代謝症候群（metabolic syndrome）的敘述，下列何者錯誤？
A. 與肥胖及年齡有關，胰島素阻抗為可能的病理成因
B. 病人可能會有血壓或血糖的升高
C. 有代謝症候群的人罹患心臟血管疾病的風險會上升
D. 診斷的條件包括高三酸甘油脂血症及低密度脂蛋白膽固醇升高

正確答案：D. 診斷的條件包括高三酸甘油脂血症及低密度脂蛋白膽固醇升高